Clinical trial exclusion criterion:
Patient is unable to take warfarin or other oral anti-coagulant medication.

Entity relations:
- Has_mood("warfarin", "unable to take")
- OR("warfarin", "oral anti-coagulant medication")